Clinical trial inclusion criterion:
ONB within 1 year post-surgery.

Entity relations:
- Has_index("within 1 year post-surgery", "surgery")
- AND("surgery", "surgery")